Clinical trial exclusion criterion:
Contraindication to vaginal delivery

Entity relations:
- AND("Contraindication", "vaginal delivery")